Clinical trial inclusion criterion:
with use of any of the approved vascular closure devices

Annotated entities:
- Device: "vascular closure devices"